臺灣地區已邁入老年社會，下列有關老人常見的良性攝護腺肥大所進行的經尿道攝護腺切除（TURP）之麻醉的考量，何者錯誤？
A. 架腳（lithotomy）的姿勢會影響肺FRC（functional residual capacity）
B. 通常實施半身麻醉，但術前評估心肺功能仍是必要
C. 術中發生意識變化時，應抽血檢查血氧與血中鈉離子濃度
D. 經尿道攝護腺切除症候群（TURP syndrome），因屬體液太多，血壓一定下降

正確答案：D. 經尿道攝護腺切除症候群（TURP syndrome），因屬體液太多，血壓一定下降